Clinical trial inclusion criterion:
3. Must have baseline bone marrow sample taken.

Annotated entities:
- Procedure: "bone marrow sample"
- Temporal: "baseline"